Clinical trial inclusion criterion:
All prevalent patients (diagnosed >12 month ago) with PAH or distal CTEPH who had a consultation at the PH centre in Zurich between November 2015 and November 2016)

Annotated entities:
- Temporal: ">12 month ago"
- Condition: "PAH"
- Condition: "CTEPH"
- Qualifier: "distal"
- Non-query-able: "consultation at the PH centre"
- Visit: "Zurich"
- Temporal: "between November 2015 and November 2016"
- Visit: "consultation at the PH centre"
- Context_Error: "prevalent"